Human immunodeficiency virus-positive status

The above is a clinical trial exclusion criterion. Annotated with entity spans:
[Measurement: Human immunodeficiency virus]-[Value: positive] status